Clinical trial inclusion criterion:
History of MDR gram-negative infection or sepsis due to organisms sensitive to colistin.

Entity relations:
- Has_qualifier("gram-negative infection", "MDR")
- Has_qualifier("organisms", "sensitive to colistin")
- OR("gram-negative infection", "sepsis")